Clinical trial inclusion criterion:
uterine size <12 weeks.

Annotated entities:
- Measurement: "uterine size"
- Value: "<12 weeks"